Clinical trial inclusion criterion:
DSM-5 diagnosis of insomnia

Entity relations:
- Has_qualifier("insomnia", "DSM-5")